Disseminated intravascular coagulation

The above is a clinical trial exclusion criterion. Annotated with entity spans:
[Condition: Disseminated intravascular coagulation]